History of life threatening allergy, anaphylactic reaction, or systemic response to human plasma derived products.

The above is a clinical trial exclusion criterion. Annotated with entity spans:
[Temporal: History] of [Condition: life threatening allergy], [Condition: anaphylactic reaction], or [Condition: systemic response to human plasma derived products].